一位 6 歲男童因弓形腿（bow leg）就診，你判定他可能罹患佝僂症（rickets）。下列那一項實驗室檢查結果並不支持你的想法？
A. 低血鈣（hypocalcemia）
B. 正常血鈣值
C. 正常血清鹼性磷酸酶（alkaline phosphatase）值
D. 低血磷（hypophosphatemia）

正確答案：C. 正常血清鹼性磷酸酶（alkaline phosphatase）值